Clinical trial exclusion criterion:
Estimated IQ < 70

Entity relations:
- Has_value("Estimated IQ", "< 70")